Patient received acetaminophen within the past 4 hours

The above is a clinical trial exclusion criterion. Annotated with entity spans:
Patient received [Drug: acetaminophen] [Temporal: within the past 4 hours]